¿Cuál de los siguiente detectores se utiliza en Espectroscopia de Infrarrojos?
1. Tubo fotomultiplicador.
2. Detector de ionización de llama.
3. Potenciostato.
4. Contador proporcional.
5. Cristal de sulfato de triglicina deuterado.

Respuesta correcta: 5. Cristal de sulfato de triglicina deuterado.